mobile plaque in the aorta;

The above is a clinical trial exclusion criterion. Annotated with entity spans:
[Condition: mobile plaque in the aorta];